Clinical trial exclusion criterion:
Hepatitis B, hepatitis C (excluding healthy carriers) or HIV positive

Annotated entities:
- Condition: "Hepatitis B"
- Condition: "hepatitis C"
- Condition: "HIV positive"
- Negation: "excluding"
- Condition: "healthy carriers"